What is the mechanism of action of Vericiguat?

Vericiguat is a stimulator of soluble guanylate cyclase. It was developed for treatment of chronic heart failure with reduced ejection fraction.